Clinical trial exclusion criterion:
Cardiac surgery

Annotated entities:
- Procedure: "Cardiac surgery"